Clinical trial inclusion criterion:
Weight stable (<3 kg weight change within last 3 months)

Entity relations:
- Subsumes("stable", "<3 kg weight change")
- Has_qualifier("Weight", "stable")
- Has_temporal("Weight", "within last 3 months")